下列那一種狀況不會發生於維生素 D 缺乏症（vitamin D deficiency）？
A. 正常血鈣值
B. 低磷酸鹽血症（hypophosphatemia）
C. 正常血清 25 羥維生素 D（25-hydroxyvitamin D）值
D. 正常血清 1,25 二羥維生素 D（1,25-dihydroxyvitamin D）值

正確答案：C. 正常血清 25 羥維生素 D（25-hydroxyvitamin D）值